Clinical trial exclusion criterion:
Life expectancy <6 months.

Annotated entities:
- Observation: "Life expectancy"
- Value: "<6 months"